Clinical trial exclusion criterion:
decompensated liver cirrhosis (Child-Pugh score above 6)

Annotated entities:
- Condition: "liver cirrhosis"
- Qualifier: "decompensated"
- Measurement: "Child-Pugh score"
- Value: "above 6"